Clinical trial inclusion criterion:
HCV RNA > 103 IU/mL at screening

Entity relations:
- Has_value("HCV RNA", "> 103 IU/mL")
- Has_temporal("HCV RNA", "at screening")
- Has_index("at screening", "screening")